Clinical trial exclusion criterion:
Unstable asthma or which may have required urgent care, hospitalization or intubation within the last 2 years, or which requires use of oral or intravenous corticosteroid.

Annotated entities:
- Condition: "Unstable asthma"
- Qualifier: "required urgent care"
- Procedure: "hospitalization"
- Procedure: "urgent care"
- Procedure: "intubation"
- Qualifier: "required hospitalization"
- Qualifier: "required intubation"
- Temporal: "within the last 2 years"
- Drug: "oral corticosteroid"
- Drug: "intravenous corticosteroid"
- Qualifier: "requires use of oral corticosteroid"
- Qualifier: "requires use of intravenous corticosteroid"